Clinical trial exclusion criterion:
ASA>3

Entity relations:
- Has_value("ASA", ">3")